下列何種抗瘧疾藥物中毒時會產生皮膚發紅、流汗、頭暈、嘔吐、下痢、耳鳴及視覺模糊等副作用？
A. Primaquine
B. Pyrimethamine
C. Quinine
D. Amodiaquine

正確答案：C. Quinine